Los cloruros de ácido, pueden transformarse en ácidos carboxílicos:
1. Mediante una hidrólisis catalizada por un ácido o una base.
2. Mediante una reacción de reducción con hidruro de litio y aluminio.
3. Mediante una reacción de reducción con borohidruro de sodio.
4. Mediante una reacción de reducción con diborano.
5. No es posible por la falta de reactividad que caracteriza a los halogenuros de acilo.

Respuesta correcta: 1. Mediante una hidrólisis catalizada por un ácido o una base.